13. Serum aspartate transaminase (AST) and/or alanine transaminase (ALT) ≤2.5 × ULN

The above is a clinical trial inclusion criterion. Annotated with entity spans:
13. [Measurement: Serum aspartate transaminase (AST)] and/or [Measurement: alanine transaminase (ALT)] [Value: ≤2.5 × ULN]